previous thoracic surgery or thrombolytic therapy for pleural infection;

The above is a clinical trial exclusion criterion. Annotated with entity spans:
[Temporal: previous] [Procedure: thoracic surgery] or [Procedure: thrombolytic therapy] for [Condition: pleural infection];